Clinical trial exclusion criterion:
DSA > 1500 MFI

Annotated entities:
- Measurement: "DSA"
- Value: "> 1500 MFI"